Recurrent varicose veins

The above is a clinical trial exclusion criterion. Annotated with entity spans:
[Multiplier: Recurrent] [Condition: varicose veins]